50歲婦女，6年前因子宮肌瘤切除子宮，主訴心悸、熱潮紅、失眠，血液中FSH濃度50 mIU/mL，最適當的藥物治療為：
A. 雌激素
B. 黃體素
C. 雌激素合併黃體素
D. 雄性素

正確答案：A. 雌激素